Una paciente de 67 años en tratamiento con ticlopidina acude a urgencias con cefalea, astenia y petequias en extremidades inferiores. En la analítica presenta hemoglobina 8,2 g/dl, VCM 100 fl, plaquetas 25000/ul y leucocitos 7500/ul con fórmula normal. La cifra de reticulocitos está elevada y en el frotis de sangre se observa numerosos esquistocitos. Los estudios de coagulación (TTPA, TP y Fibrinógeno) son normales. En la bioquímica destaca LDH 2700 UI/l y bilirrubina 2,6 mg/dl. ¿Cuál es el diagnóstico más probable de la paciente?
1. Púrpura trombocitopénica autoinmune.
2. Púrpura trombótica trombocitopénica.
3. Aplasia medular.
4. Trombocitopenia inducida por fármacos.
5. Coagulación intravascular diseminada.

Respuesta correcta: 2. Púrpura trombótica trombocitopénica.